8. Negative pregnancy test (if female of childbearing potential)

The above is a clinical trial inclusion criterion. Annotated with entity spans:
[Parsing_Error: 8.] [Value: Negative] [Measurement: pregnancy test] (if [Person: female] of [Condition: childbearing potential])